Clinical trial exclusion criterion:
With acute diseases, such as acute phase after myocardial infarction (within 3 months), within 3 months after acute heart failure or new cerebral infarction;

Entity relations:
- Has_temporal("myocardial infarction", "acute phase")
- Subsumes("acute phase", "within 3 months")
- Has_temporal("acute heart failure", "within 3 months")
- Subsumes("acute diseases", "myocardial infarction")
- OR("acute heart failure", "cerebral infarction")
- OR("myocardial infarction", "acute heart failure")